What is the indication for Mirabegron?

Mirabegron, the first 尾3-adrenoceptor agonist in clinical practice, is approved for treatment of overactive bladder (OAB) syndrome symptoms.